Patients with a baseline (pre-operative) opioid use greater than 30 mg of morphine equivalents/day.

The above is a clinical trial exclusion criterion. Annotated with entity spans:
Patients with a [Qualifier: baseline] ([Qualifier: pre-operative]) [Drug: opioid] use [Multiplier: greater than 30 mg of morphine equivalents/day].